Where is the yeast transpozable element Ty3 preferentially inserted?

Ty3 integrates within the region of RNA polymerase III transcription initiation. Thus, genomic insertions of Ty3 in a particular orientation are apparently specified by the target, while the actual position of the insertion relative to the tRNA-coding sequence can vary slightly.